Clinical trial exclusion criterion:
Patients with an expected life expectancy <48 hours

Entity relations:
- Has_value("expected life expectancy", "<48 hours")